Clinical trial exclusion criterion:
Currently prescribed pharmacotherapy for alcohol dependence (not including treatment of acute alcohol withdrawal syndrome)

Entity relations:
- AND("pharmacotherapy", "alcohol dependence")
- Has_temporal("pharmacotherapy", "Currently")
- AND("treatment", "acute alcohol withdrawal syndrome")
- Has_negation("treatment", "not including")
- AND("pharmacotherapy", "treatment")